Patients in whom first attempt of arterial puncture is performed by 2nd year interventional cardiology fellow or by physician in charge.

The above is a clinical trial exclusion criterion. Annotated with entity spans:
[Non-query-able: Patients in whom first attempt of arterial puncture is performed by 2nd year interventional cardiology fellow or by physician in charge].